having given written consent to participation in the study

The above is a clinical trial inclusion criterion. Annotated with entity spans:
[Informed_consent: having given written consent to participation in the study]